No history of GI pathology

The above is a clinical trial inclusion criterion. Annotated with entity spans:
[Negation: No] [Temporal: history] of [Condition: GI pathology]